Clinical trial exclusion criterion:
ICU postoperative recovery;

Annotated entities:
- Observation: "ICU postoperative recovery"